Clinical trial exclusion criterion:
Patients requiring long-acting opioid pain management (including fentanyl patch, oxycontin, etc) for over 3 weeks immediately prior to surgery

Annotated entities:
- Drug: "long-acting opioid"
- Mood: "requiring"
- Drug: "fentanyl patch"
- Drug: "oxycontin"
- Multiplier: "for over 3 weeks"
- Temporal: "immediately prior to surgery"